Clinical trial exclusion criterion:
Poor health literacy

Annotated entities:
- Observation: "Poor health literacy"